Use of any vaccine type within 30 days before the vaccination of the study;

The above is a clinical trial exclusion criterion. Annotated with entity spans:
Use of [Drug: any vaccine type] [Temporal: within 30 days before the vaccination of the study];